一位 60 歲病人休息時發生胸痛，持續時間約 30 分鐘，含硝化甘油舌下片無效，心電圖正常，胸部 X 光心臟正常，且心肌酵素沒上升，他的診斷最有可能是：
A. 臥位心絞痛
B. 勞動心絞痛
C. 急性心肌梗塞
D. 不穩定性心絞痛

正確答案：D. 不穩定性心絞痛